Clinical trial inclusion criterion:
Diagnosis of prostate adenocarcinoma histologically confirmed at MSKCC.

Annotated entities:
- Condition: "prostate adenocarcinoma"
- Procedure: "histologically"
- Value: "confirmed"
- Qualifier: "histologically confirmed"